Clinical trial exclusion criterion:
History of three or more miscarriages

Entity relations:
- Has_multiplier("miscarriages", "three or more")